早發而持續之行為規範障礙（conduct disorder）患者預後較差，部分會發展成何種人格異常？
A. 妄想型人格異常
B. 邊緣型人格異常
C. 反社會型人格異常
D. 戲劇型人格異常

正確答案：C. 反社會型人格異常